Clinical trial inclusion criterion:
Patient has a prostate size between 90g and 200g, as determined by MRI

Entity relations:
- Has_value("prostate size", "between 90g and 200g")
- AND("prostate size", "MRI")